Osteoporosis

The above is a clinical trial inclusion criterion. Annotated with entity spans:
[Condition: Osteoporosis]